有關紫斑性腎炎（Henoch-Schönlein purpura nephritis）的描述，下列何者錯誤？
A. 過敏性紫斑症的病童中有部分患者會出現血尿、蛋白尿
B. 過敏性紫斑症的病童中大部分會變成慢性腎炎
C. 紫斑性腎炎最常發生在過敏性紫斑症發病後 3 個月內
D. 紫斑性腎炎若以單純的微觀性血尿（isolated microscopic hematuria）表現者，其預後最好

正確答案：B. 過敏性紫斑症的病童中大部分會變成慢性腎炎